Clinical trial inclusion criterion:
1. Presence of bacteremia due solely to:

Annotated entities:
- Condition: "bacteremia"
- Parsing_Error: "due solely to:"